有關骨質疏鬆（osteoporosis）之復健原則，下列何者為非？
A. 應以游泳增加骨密度
B. 要教育病人如何避免跌倒
C. 要教導病人提抬重物的正確方法
D. 病人可從事太極拳運動

正確答案：A. 應以游泳增加骨密度